Clinical trial inclusion criterion:
8. Reached an average daily pain rating during the baseline week of pain ratings greater than 4 on the 0-to-10 numerical pain rating scale (Question 5 of the BPI)

Entity relations:
- multi("during the baseline week", "baseline week")
- Has_temporal("daily pain rating", "during the baseline week")
- Has_qualifier("daily pain rating", "average")
- AND("daily pain rating", "0-to-10 numerical pain rating scale")
- Has_value("daily pain rating", "greater than 4")